Clinical trial exclusion criterion:
with a history of mental illness and/or family history of mental illness limb disabled.

Annotated entities:
- Condition: "mental illness"
- Temporal: "history"
- Observation: "family history"
- Condition: "mental illness"
- Qualifier: "limb disabled"